What is the target of the drug Olaparib?

The drug Olaparib target the protein poly(ADP-ribose) polymerase.